oral anticoagulation that cannot be safely discontinued for the duration of the study

The above is a clinical trial inclusion criterion. Annotated with entity spans:
[Procedure: oral anticoagulation] that [Qualifier: cannot be safely discontinued] [Temporal: for the duration of the study]